Which methods are used for genome segmentation of gene expression data?

Most of the used methods are variations of Markov Models such as Markov Chain Monte Carlo (MCMC) or Combinatorial methods.